Clinical trial exclusion criterion:
Treated currently with golimumab or certolizumab

Entity relations:
- OR("golimumab", "certolizumab")